Bleeding disorder, or receipt of anticoagulants in the 3 weeks preceding inclusion, contraindicating intramuscular vaccination

The above is a clinical trial exclusion criterion. Annotated with entity spans:
[Condition: Bleeding disorder], or receipt of [Drug: anticoagulants] [Temporal: in the 3 weeks preceding inclusion], [Condition: contraindicating] [Procedure: intramuscular vaccination]